What is the function of Taraxasterol  in rheumatoid arthritis?

Protective effect of taraxasterol against rheumatoid arthritis by the modulation of inflammatory responses